Clinical trial exclusion criterion:
Gastric outlet obstruction or intestinal obstruction

Entity relations:
- OR("Gastric outlet obstruction", "intestinal obstruction")